Clinical trial exclusion criterion:
Patients who have had a major life event in the past three months, which in the judgement of the investigator is influencing their current condition.

Annotated entities:
- Non-query-able: "Patients who have had a major life event in the past three months, which in the judgement of the investigator is influencing their current condition"